Clinical trial inclusion criterion:
Cerebral palsy of any types caused by Neonatal Jaundice

Annotated entities:
- Condition: "Neonatal Jaundice"
- Condition: "Cerebral palsy"